Age18-65

The above is a clinical trial inclusion criterion. Annotated with entity spans:
[Person: Age][Value: 18-65]